Evidence of oral distant metastasis or other malignancies

The above is a clinical trial exclusion criterion. Annotated with entity spans:
Evidence of [Qualifier: oral] [Qualifier: distant] [Condition: metastasis] or [Qualifier: other] [Condition: malignancies]